Clinical trial exclusion criterion:
Hepatic disease or biliary tract obstruction, or significant hepatic enzyme elevation (alanine transaminase or Aspartate Aminotransferase > 3 times upper limit of normal)

Annotated entities:
- Condition: "Hepatic disease"
- Condition: "biliary tract obstruction"
- Condition: "hepatic enzyme elevation"
- Qualifier: "significant"
- Measurement: "alanine transaminase"
- Measurement: "Aspartate Aminotransferase"
- Value: "> 3 times upper limit of normal"